Clinical trial exclusion criterion:
Any use of a very-low-calorie (<1000 calories/day) weight loss diet within 6 months before Screening

Entity relations:
- Has_value("very-low-calorie weight loss diet", "<1000 calories/day")
- Has_index("within 6 months before Screening", "Screening")
- Has_temporal("very-low-calorie weight loss diet", "within 6 months before Screening")